Para Mechanic al reconocimiento e interpretación de síntomas NO contribuyen:
1. La disponibilidade recursos, el coste psicológico y el económico.
2. Las características de la relación médicopaciente.
3. La percepción y peligrosidad de los síntomas.
4. La información, las creencias y el conocimiento.

Respuesta correcta: 2. Las características de la relación médicopaciente.